Clinical trial inclusion criterion:
Child-Pugh score <12

Annotated entities:
- Measurement: "Child-Pugh score"
- Value: "<12"